Clinical trial exclusion criterion:
Recanalized (TIMI I-III flow) IRA at coronary angiography.

Entity relations:
- Has_qualifier("Recanalized", "TIMI I-III flow")
- AND("Recanalized", "IRA")